Clinical trial exclusion criterion:
Malignancy(diagnosed or under investigation)

Annotated entities:
- Condition: "Malignancy"
- Mood: "diagnosed"
- Mood: "under investigation"